Clinical trial inclusion criterion:
presence of benign cause for the hysterectomy e.g. fibroid uterus, perimenopausal beeding not responding to medical treatment or complex endometrial hyperplasia without atypia.

Annotated entities:
- Condition: "benign cause"
- Procedure: "hysterectomy"
- Condition: "fibroid uterus"
- Condition: "perimenopausal beeding"
- Negation: "not"
- Qualifier: "responding to medical treatment"
- Procedure: "medical treatment"
- Condition: "complex endometrial hyperplasia"
- Negation: "without"
- Condition: "atypia"